Clinical trial inclusion criterion:
Decreased response to levodopa combination drugs

Annotated entities:
- Condition: "Decreased response"
- Drug: "evodopa combination drugs"